Clinical trial exclusion criterion:
Frank psychosis

Annotated entities:
- Condition: "psychosis"
- Qualifier: "Frank"